一位 34 歲女性因右上腹疼痛 1 個月求診，她並無噁心、嘔吐、體重下降或排便習慣的改變。過去病史並無特別，只有長期吃綜合維他命及避孕藥。最後電腦斷層及磁振造影檢查看到肝臟右葉有兩個 公分腫瘤，高度顯示為肝腺瘤（hepatocellular adenoma），您認為下一步以下列何者最適當？
A. 只要觀察，不必改變
B. 停避孕藥
C. 手術切除
D. 電腦斷層或超音波引導下做肝腫瘤穿刺切片，作病理診斷

正確答案：B. 停避孕藥